Adult patient, age 18-80 years old, with ruptured aneurysm(s) who experience cerebral vasospasm post operatively within 3-21 days.

The above is a clinical trial inclusion criterion. Annotated with entity spans:
[Person: Adult] patient, [Person: age] [Value: 18-80 years old], with [Condition: ruptured aneurysm](s) who experience [Condition: cerebral vasospasm] [Temporal: post operatively within 3-21 days].